Clinical trial exclusion criterion:
Bleeding disorders.

Annotated entities:
- Condition: "Bleeding disorders"